Clinical trial exclusion criterion:
prostatic hypertrophy, stroke, or ulcer in past year

Entity relations:
- OR("prostatic hypertrophy", "stroke", "ulcer")